Clinical trial exclusion criterion:
Heart rate <60 beats/min

Annotated entities:
- Measurement: "Heart rate"
- Value: "<60 beats/min"